Clinical trial inclusion criteria:
Age: 18 to75 years old;
Pathologically diagnosed with advanced gastric cancer (including adenocarcinoma of the gastroesophageal junction) with measurable metastases outside the stomach (measuring = 10mm on spiral CT scan, satisfying the criteria in RECIST 1.1);
Failure of prior therapy (during or after treatment) in patients who have received at least two prior chemotherapy regimens;
ECOG PS of 0-2;
HB = 90g / L
ANC = 1.5 × 109 / L
PLT = 80 × 109 / L
Bilirubin <1.25 times the upper limit of normal (ULN)
ALT and AST <2.5 × ULN; liver metastases, if any, the ALT and AST<5 × ULN
Serum Cr = 1 × ULN endogenous creatinine clearance>50ml/min (Cockcroft-Gault formula)
An expected survival of = 3 months;
Patient received apatinib treatment regimen at investigators' discretion;
Patient has to voluntarily join the study and sign the Informed Consent Form for the study;
Pregnancy test (serum or urine) has to be performed for woman of childbearing age within 7 days before enrolment and the test result must be negative. They shall take appropriate methods for contraception during the study until the 8th week post the last administration of study drug. For men, (previous surgical sterilization accepted), shall agree to take appropriate methods of contraception during the study until the 8th week post the last administration of study drug.

Annotated entities:
- Person: "Age"
- Value: "18 to75 years old"
- Condition: "advanced gastric cancer"
- Condition: "adenocarcinoma"
- Qualifier: "gastroesophageal junction"
- Condition: "metastases"
- Negation: "outside"
- Qualifier: "stomach"
- Multiplier: "at least two"
- Procedure: "chemotherapy"
- Qualifier: "Failure"
- Measurement: "ECOG PS"
- Value: "0-2"
- Measurement: "HB"
- Value: "= 90g / L"
- Measurement: "ANC"
- Value: "= 1.5 × 109 / L"
- Measurement: "PLT"
- Value: "= 80 × 109 / L"
- Measurement: "Bilirubin"
- Value: "<1.25 times the upper limit of normal"
- Measurement: "ALT"
- Measurement: "AST"
- Value: "<2.5 × ULN"
- Condition: "liver metastases"
- Measurement: "ALT"
- Measurement: "AST"
- Value: "<5 × ULN"
- Measurement: "Serum Cr"
- Value: "= 1 × ULN"
- Measurement: "endogenous creatinine clearance"
- Value: ">50ml/min"
- Observation: "expected survival"
- Value: "= 3 months"
- Drug: "apatinib"
- Informed_consent: "Patient has to voluntarily join the study and sign the Informed Consent Form for the study;"
- Pregnancy_considerations: "Pregnancy test (serum or urine) has to be performed for woman of childbearing age within 7 days before enrolment and the test result must be negative. They shall take appropriate methods for contraception during the study until the 8th week post the last administration of study drug. For men, (previous surgical sterilization accepted), shall agree to take appropriate methods of contraception during the study until the 8th week post the last administration of study drug"